Measurable disease

The above is a clinical trial inclusion criterion. Annotated with entity spans:
[Context_Error: Measurable disease]